Clinical trial inclusion criterion:
Subject must have been previously immunized for smallpox, at =3 years prior to commencement of screening assessments, and vaccination history must be confirmed by oral or written history and the presence of a visible pathognomonic smallpox vaccination scar.

Annotated entities:
- Condition: "smallpox"
- Procedure: "immunized"
- Temporal: "3 years prior to commencement of screening assessments"
- Reference_point: "commencement of screening assessments"
- Non-query-able: "and vaccination history must be confirmed by oral or written history and the presence of a visible pathognomonic smallpox vaccination"